Patient has received a liver transplant from a decrease donor > 70 years of age

The above is a clinical trial exclusion criterion. Annotated with entity spans:
Patient has received a [Procedure: liver transplant] from a decrease [Person: donor] [Value: > 70 years] of [Person: age]